下列何者不是絨毛膜（chorion）的組成結構？
A. 細胞滋養層（cytotrophoblast）
B. 融合滋養層（syncytiotrophoblast）
C. 胚外體壁中胚層（extraembryonic somatic mesoderm）
D. 胚外臟壁中胚層（extraembryonic splanchnic mesoderm）

正確答案：D. 胚外臟壁中胚層（extraembryonic splanchnic mesoderm）